下列藥物何者同時具有抑制 Cholesterol side-chain-cleaving enzyme 和 Aromatase 之能力？
A. Aminoglutethimide
B. Raloxifene
C. Clomiphene
D. Mifepristone

正確答案：A. Aminoglutethimide